Scheduled for gynecological laparoscopic surgery

The above is a clinical trial inclusion criterion. Annotated with entity spans:
[Mood: Scheduled] for [Qualifier: gynecological] [Procedure: laparoscopic surgery]